服用下列何種血管舒張劑易產生多毛症的副作用？
A. hydralazine
B. minoxidil
C. captopril
D. sildenafil

正確答案：B. minoxidil